在急性下肢動脈阻塞性疾病，若已完全阻塞，且時間已超過 24 小時，肢端也已有壞死現象，此時最好不要嘗試以外科手術方法來恢復血流，以避免發生何種致命的併發症？
A. 菌血症
B. 截肢
C. 再度灌流症候群（reperfusion syndrome）
D. 骨髓炎

正確答案：C. 再度灌流症候群（reperfusion syndrome）